Life expectancy greater than one year.

The above is a clinical trial inclusion criterion. Annotated with entity spans:
[Observation: Life expectancy] [Value: greater than one year].